history of fetal cytomegalovirus infection

The above is a clinical trial exclusion criterion. Annotated with entity spans:
history of [Qualifier: fetal] [Condition: cytomegalovirus infection]